Clinical trial exclusion criterion:
Subjects with non-functional CICC or PICC distal ports

Annotated entities:
- Device: "CICC distal ports"
- Device: "PICC distal ports"
- Qualifier: "non-functional"